Clinical trial exclusion criterion:
Severe autoimmune disease, e.g. lupus erythematosus, multiple sclerosis.

Entity relations:
- Subsumes("autoimmune disease", "lupus erythematosus")
- Has_qualifier("autoimmune disease", "Severe")
- OR("lupus erythematosus", "multiple sclerosis")